Clinical trial exclusion criterion:
Diagnosis of any other neurologic disease

Annotated entities:
- Condition: "neurologic disease"
- Qualifier: "any other"